暴露於下列何種危害物最可能造成鼻中膈穿孔？
A. 四氯化碳
B. 二甲機甲醯胺
C. 鉻酸
D. 有機磷

正確答案：C. 鉻酸